4. Preexisting neurological disorders, dementia or previous stroke;

The above is a clinical trial exclusion criterion. Annotated with entity spans:
[Parsing_Error: 4.] [Temporal: Preexisting] [Condition: neurological disorders], [Condition: dementia] or [Temporal: previous] [Condition: stroke];